Clinical trial inclusion criterion:
Can achieve best corrected spectacle distance visual acuity of 20/25 (0.10 logMAR) or better in each eye.

Entity relations:
- Subsumes("20/25 or better", "0.10 logMAR or better")
- Has_value("best corrected spectacle distance visual acuity", "20/25 or better")